Clinical trial inclusion criterion:
No prior ART, including prior administration of pre- and post-exposure prophylaxis in the last 30 days

Annotated entities:
- Negation: "No"
- Temporal: "prior"
- Procedure: "ART"
- Temporal: "prior"
- Procedure: "administration"
- Drug: "post-exposure prophylaxis"
- Drug: "pre- exposure prophylaxis"
- Temporal: "in the last 30 days"